Según la ecuación de Arrhenius (k = A e-Ea/RT):
1. La velocidad de una reacción es directamente proporcional a la temperatura.
2. Una energía de activación alta implica que la constante de velocidad depende marcadamente de la temperatura.
3. El factor preexponencial o factor de frecuencia (A) es adimensional.
4. La energía de activación depende de la temperatura.
5. La energía de activación es siempre negativa.

Respuesta correcta: 2. Una energía de activación alta implica que la constante de velocidad depende marcadamente de la temperatura.